What is caused by SCUBE2 loss-of-function?

Loss-of-function of SCUBE2 causes loss of function, disruption of osteoblast differentiation, bone formation and endochondral bone formation.